Clinical trial exclusion criterion:
With periodontium with periodontal parameters different from those established in the inclusion criteria.

Annotated entities:
- Non-representable: "With periodontium with periodontal parameters different from those established in the inclusion criteria."